ischemic cardiomyopathy with or without previous myocardial infarction or

The above is a clinical trial inclusion criterion. Annotated with entity spans:
[Condition: ischemic cardiomyopathy] with or without [Temporal: previous] [Condition: myocardial infarction] or